Clinical trial exclusion criteria:
1. High risk profiles for ischemic adverse events such as A. ST-segment elevation myocardial infarction (STEMI) B. Patients with cardiogenic shock or concomitant severe decompensated heart failure C. Myocardial infarction or stent thrombosis in spite of the maintenance of antiplatelet therapy D. Restenosis in stented segments or previous sites of balloon angioplasty 2. Patients who cannot follow allocated DAPT schedule due to the planned surgery or elective procedure within 3 months after the stenting 3. Recent history of major surgery or evident events of gastrointestinal bleeding within 1 month from the procedure 4. Patients on anticoagulation therapy with warfarin or other anticoagulants 5. Life expectancy less than 1 year (such as malignancies or other chronic systemic diseases) 6. Pregnant women 7. Past history of allergy or other contraindications for the following medications/materials: aspirin, clopidogrel, heparin, cobalt chromium, sirolimus

Annotated entities:
- Line: "1. High risk profiles for ischemic adverse events such as A. ST-segment elevation myocardial infarction (STEMI) B. Patients with cardiogenic shock or concomitant severe decompensated heart failure C. Myocardial infarction or stent thrombosis in spite of the maintenance of antiplatelet therapy D. Restenosis in stented segments or previous sites of balloon angioplasty"
- Line: "2. Patients who cannot follow allocated DAPT schedule due to the planned surgery or elective procedure within 3 months after the stenting"
- Line: "3. Recent history of major surgery or evident events of gastrointestinal bleeding within 1 month from the procedure"
- Line: "4. Patients on anticoagulation therapy with warfarin or other anticoagulants"
- Line: "5. Life expectancy less than 1 year (such as malignancies or other chronic systemic diseases)"
- Line: "6. Pregnant women"
- Line: "7. Past history of allergy or other contraindications for the following medications/materials: aspirin, clopidogrel, heparin, cobalt chromium, sirolimus"
- Condition: "ischemic adverse events"
- Condition: "High risk profiles"
- Condition: "ST-segment elevation myocardial infarction (STEMI)"
- Condition: "cardiogenic shock"
- Condition: "heart failure"
- Qualifier: "severe"
- Qualifier: "decompensated"
- Condition: "Myocardial infarction"
- Condition: "stent thrombosis"
- Drug: "antiplatelet therapy"
- Condition: "Restenosis"
- Mood: "planned"
- Procedure: "surgery"
- Qualifier: "elective"
- Procedure: "procedure"
- Temporal: "within 3 months after the stenting"
- Condition: "cannot follow allocated DAPT schedule"
- Procedure: "major surgery"
- Condition: "events of gastrointestinal bleeding"
- Temporal: "within 1 month from the procedure"
- Procedure: "anticoagulation therapy"
- Drug: "warfarin"
- Qualifier: "other"
- Drug: "anticoagulants"
- Observation: "Life expectancy"
- Value: "less than 1 year"
- Condition: "malignancies"
- Condition: "chronic systemic diseases"
- Qualifier: "other"
- Condition: "Pregnant"
- Person: "women"
- Condition: "allergy"
- Condition: "contraindications"
- Qualifier: "other"
- Drug: "aspirin"
- Drug: "clopidogrel"
- Drug: "heparin"
- Drug: "cobalt chromium"
- Drug: "sirolimus"